Clinical trial inclusion criterion:
Having an education degree of high school or above

Annotated entities:
- Person: "degree of high school"